以下何種肝炎病毒常是造成旅行者肝炎（traveler hepatitis）的元凶，並且懷孕婦女感染有將近20%的死亡率？
A. A型肝炎病毒
B. B型肝炎病毒
C. D型肝炎病毒
D. E型肝炎病毒

正確答案：D. E型肝炎病毒